Clinical trial exclusion criterion:
HIV infected participants who are on anti-retroviral drugs

Annotated entities:
- Condition: "HIV infected"
- Drug: "anti-retroviral drugs"